Which gene is mutated in a subtype of arrhythmogenic right ventricular cardiomyopathy known as Naxos disease?

A homozygous loss-of-function mutation of the Plakoglobin (Jup) gene, had been identified in Naxos Disease patients, a subset of ARVC, which is characterized by cutaneous disorder.